Clinical trial exclusion criterion:
evident dysfunction of cardia,liver and kidney, or pregnant women or women during lactation

Entity relations:
- OR("dysfunction of cardia", "dysfunction of liver", "pregnant", "lactation", "dysfunction of kidney")